下列何者不是Phase I的代謝反應？
A. Oxidation
B. Hydrolysis
C. Conjugation
D. Reduction

正確答案：C. Conjugation